patients undergoing partial or full resection of the pancreas due to a benign or malignant tumor

The above is a clinical trial inclusion criterion. Annotated with entity spans:
patients undergoing [Procedure: partial] or [Procedure: full resection of the pancreas] due to a [Condition: benign] or [Condition: malignant tumor]